Clinical trial inclusion criterion:
Have their health care provider's permission to enroll in the study.

Annotated entities:
- Non-query-able: "Have their health care provider's permission to enroll in the study."